History of unstable progressive neurologic disorder of unknown cause

The above is a clinical trial exclusion criterion. Annotated with entity spans:
[Temporal: History] of [Qualifier: unstable] [Condition: progressive neurologic disorder] of [Qualifier: unknown cause]